以 statin 併服 niacin 治療高血脂症，不會降低下列何種血脂成分？
A. LDL-C
B. Triglyceride
C. Apo B
D. HDL-C

正確答案：D. HDL-C